Clinical trial exclusion criteria:
Inability to provide an informed consent
Evidence of oral distant metastasis or other malignancies
The patient has received prior surgery for primary tumor or lymph node ( except for biopsy )
Prior radiotherapy for primary tumor
The patient has previously received anti-tumor biological targeted therapy
The patient has received chemotherapy or immunotherapy for primary tumors
Prior malignancy within the previous 5 years (except for cured skin basal cell carcinoma or cervical carcinoma in situ)
With 3-4 grad Allergy to any drug in the treatment
Peripheral neuropathy> 1 grade
Any unstable systematic disease (including active infection, uncontrolled high blood pressure, unstable angina, onset of angina within the last 3 months, congestive heart failure, myocardial infarction within the previous 12 months, severe arrhythmia needing drug treatment, liver, kidney or metabolic disease)
HIV positive
Chronic diseases requiring immune agents or hormone therapy
Pregnant or lactating women
Drug/alcohol abuse, psychological or spiritual illness that may interfere compliance to the study
Patients with epilepsy requiring medications (such as steroids or antiepileptic drugs)
The patient has participated in other experimental therapy studies within 30 days
Researchers believe that the situation is unsuitable for participation in the group

Annotated entities:
- Non-query-able: "Inability to provide an informed consent"
- Qualifier: "distant"
- Qualifier: "oral"
- Condition: "metastasis"
- Qualifier: "other"
- Condition: "malignancies"
- Temporal: "prior"
- Procedure: "surgery"
- Qualifier: "primary"
- Condition: "tumor"
- Condition: "lymph node"
- Procedure: "biopsy"
- Negation: "except for"
- Procedure: "radiotherapy"
- Temporal: "Prior"
- Qualifier: "primary"
- Condition: "tumor"
- Procedure: "anti-tumor biological targeted therapy"
- Temporal: "previously"
- Procedure: "chemotherapy"
- Procedure: "immunotherapy"
- Condition: "primary tumors"
- Condition: "malignancy"
- Temporal: "Prior"
- Temporal: "within the previous 5 years"
- Condition: "cured skin basal cell carcinoma"
- Condition: "cervical carcinoma in situ"
- Negation: "except for"
- Qualifier: "3-4 grad"
- Condition: "Allergy"
- Drug: "drug"
- Qualifier: "any"
- Condition: "Peripheral neuropathy"
- Qualifier: "> 1 grade"
- Condition: "systematic disease"
- Qualifier: "unstable"
- Condition: "infection"
- Condition: "high blood pressure"
- Qualifier: "uncontrolled"
- Condition: "unstable angina"
- Temporal: "within the last 3 months"
- Measurement: "onset"
- Condition: "angina"
- Condition: "congestive heart failure"
- Condition: "myocardial infarction"
- Temporal: "within the previous 12 months"
- Qualifier: "severe"
- Condition: "arrhythmia"
- Drug: "drug"
- Procedure: "treatment"
- Condition: "metabolic disease"
- Condition: "kidney disease"
- Condition: "liver disease"
- Condition: "HIV positive"
- Condition: "Chronic diseases"
- Drug: "immune agents"
- Procedure: "hormone therapy"
- Condition: "Pregnant"
- Condition: "lactating"
- Person: "women"
- Intoxication_considerations: "Drug/alcohol abuse, psychological or spiritual illness that may interfere compliance to the study"
- Condition: "epilepsy"
- Drug: "medications"
- Drug: "steroids"
- Drug: "antiepileptic drugs"
- Non-query-able: "The patient has participated in other experimental therapy studies within 30 days"
- Non-query-able: "Researchers believe that the situation is unsuitable for participation in the grou"